Clinical trial inclusion criterion:
proven acute deep venous thrombosis, less than 21 days and who were referred to the interventional radiology department.

Entity relations:
- Has_qualifier("deep venous thrombosis", "acute")
- Has_qualifier("deep venous thrombosis", "proven")
- Has_multiplier("deep venous thrombosis", "less than 21 days")
- Has_mood("interventional radiology department", "referred to")